血中腎上腺素（epineprine）濃度上升時會抑制肝臟或肌肉的何種代謝作用？
A. 肝臟的糖解作用（glycolysis）
B. 肌肉的糖解作用（glycolysis）
C. 肝臟的葡萄糖新生作用（gluconeogenesis）
D. 肌肉的肝糖分解作用（glycogenolysis）

正確答案：A. 肝臟的糖解作用（glycolysis）